感染性心內膜炎的診斷，Duke criteria 是綜合臨床資料，實驗室及心臟超音波所見的診斷標準，下列何者為主要條件（major criteria）？
A. 發燒超過 38.0℃
B. 兩套分開的血液培養長出 viridans streptococci
C. 出現動脈栓塞症
D. 有易發生感染性心內膜炎的心臟疾病

正確答案：B. 兩套分開的血液培養長出 viridans streptococci